Clinical trial exclusion criterion:
History of "Major Bleeding" at any point (defined as overt bleeding at a critical site including intracranial, intraspinal, intraocular, pericardial, or retroperitoneal; or bleed requiring hospitalization).

Annotated entities:
- Condition: "Major Bleeding"
- Temporal: "at any point"
- Temporal: "History"
- Condition: "overt bleeding"
- Qualifier: "critical site"
- Qualifier: "intracranial"
- Qualifier: "intraspinal"
- Qualifier: "intraocular"
- Qualifier: "pericardial"
- Qualifier: "retroperitoneal"
- Condition: "bleed"
- Procedure: "hospitalization"